Prepared to sign an informed consent

The above is a clinical trial inclusion criterion. Annotated with entity spans:
[Post-eligibility: Prepared to sign an informed consent]